一位50歲男性有十二指腸潰瘍的病史，但服藥不正常，最近因業務繁忙，老覺得上腹部疼痛。今天早晨一陣大痛後，忽然不痛了，但腹部腫漲。來到急診室，其最可能的臆診為何？
A. 急性膽囊炎
B. 急性肝炎
C. 膽囊破裂
D. 十二指腸潰瘍穿孔

正確答案：D. 十二指腸潰瘍穿孔